How does botulism toxin act on the muscle?

Botulinum toxin (BTX) is widely used to treat muscle spasticity by acting on motor neurons producing a flaccid paralysis. It prevents the release of the neurotransmitter acetylcholine from axon endings at the neuromuscular junction.